Clinical trial inclusion criteria:
Age = 65 years with one additional stroke risk factor (hypertension, diabetes, heart failure history of or left ventricular ejection fraction <0.40), previous stroke or transient ischemic attack).
Atrial fibrillation and not on oral anticoagulation (OAC) therapy but eligible
Atrial fibrillation on sub-optimal OAC

Annotated entities:
- Person: "Age"
- Value: "= 65 years"
- Multiplier: "one additional"
- Condition: "risk factor"
- Condition: "stroke"
- Condition: "hypertension"
- Condition: "diabetes"
- Condition: "heart failure"
- Measurement: "left ventricular ejection fraction"
- Value: "<0.40"
- Temporal: "history"
- Temporal: "previous"
- Condition: "stroke"
- Condition: "transient ischemic attack"
- Condition: "Atrial fibrillation"
- Measurement: "not"
- Procedure: "oral anticoagulation (OAC) therapy"
- Non-representable: "but eligible"
- Condition: "Atrial fibrillation"
- Procedure: "OAC"
- Qualifier: "sub-optimal"